Clinical trial inclusion criterion:
a follow-up at least 12 months

Annotated entities:
- Observation: "follow-up"
- Temporal: "at least 12 months"